病患使用呼吸器時，潮氣量 400 ml，吸氣時最大氣道壓力為 50 cmH2O，吸氣末端高地（plateau）壓力為 20 cmH2O，吐氣末端正壓設定為 10 cmH2O，則呼吸系統靜態容量彈性（static compliance）為多少 ml/cmH2O？
A. 8
B. 10
C. 20
D. 40

正確答案：D. 40